Clinical trial exclusion criterion:
Pre-existing eye diseases (glaucoma).

Entity relations:
- Has_qualifier("eye diseases", "Pre-existing")
- Subsumes("eye diseases", "glaucoma")